Clinical trial exclusion criterion:
9. Uncontrolled or intercurrent illness including, that in the opinion of the investigator may increase the risks associated with study participation or administration of the investigational products, or that may interfere with the interpretation of the results.

Entity relations:
- Has_qualifier("illness", "in the opinion of the investigator may increase the risks")
- Has_qualifier("illness", "Uncontrolled")
- OR("Uncontrolled", "intercurrent")